Which conditions is caused by mutations in HFE?

Mutations in HFE, a gene encoding a putative lysosomal trafficking protein, are the cause of hereditary hemochromatosis.